La reacción de 2-ciclohexenona con vinilcuprato de litio da el siguiente compuesto, tras hidrólisis ácida, como producto mayoritario:
1. 2-Vinil-ciclohexanona.
2. 1,3-Divinilciclohexanol.
3. 1-Vinilciclohex-3-en-1-ol.
4. 3-Vinilciclohexanona.

Respuesta correcta: 4. 3-Vinilciclohexanona.